三染色體（trisomy）的形成，主要是細胞分裂時染色體沒有平均分配到子代的細胞中。下列有關唐氏症成因的敘述，那一種可能性最高？
A. 卵子形成過程中，於第一次減數分裂時染色體分配不平均
B. 精子形成過程中，於第一次減數分裂時染色體分配不平均
C. 受精卵形成後，於前幾次有絲分裂時染色體分配不平均
D. 兩顆精子和一顆卵子共同形成受精卵

正確答案：A. 卵子形成過程中，於第一次減數分裂時染色體分配不平均